Clinical trial inclusion criterion:
ASA Physical Status II - III

Entity relations:
- Has_value("ASA Physical Status", "II - III")